Clinical trial inclusion criteria:
Diagnosis of asthma

Annotated entities:
- Condition: "asthma"